Severe or uncontrolled medical conditions that could compromise study participation

The above is a clinical trial exclusion criterion. Annotated with entity spans:
[Post-eligibility: Severe or uncontrolled medical conditions that could compromise study participation]